Clinical trial inclusion criterion:
Subjects with PID, eg, with a diagnosis of common variable immunodeficiency or X-linked agammaglobulinemia, as defined by the Pan American Group for Immune Deficiency and the European Society of Immune Deficiencies.

Annotated entities:
- Condition: "PID"
- Condition: "common variable immunodeficiency"
- Condition: "X-linked agammaglobulinemia"
- Measurement: "Pan American Group for Immune Deficiency"
- Measurement: "European Society of Immune Deficiencies"
- Non-query-able: "and"